Clinical trial exclusion criterion:
Diagnosed or past history of ASCVD (including ACS, SCAD, revascularization, ICM, ischemic stroke, TIA, PASD, etc.

Annotated entities:
- Condition: "ASCVD"
- Condition: "ACS"
- Condition: "SCAD"
- Procedure: "revascularization"
- Condition: "ICM"
- Condition: "ischemic stroke"
- Condition: "TIA"
- Condition: "PASD"